Clinical trial exclusion criterion:
Presence of psychiatric/ mental disorder or any other medical disorder which might impair the patient's ability to give informed consent or to comply with the requirements of the study protocol.

Entity relations:
- Has_context("psychiatric disorder", "impair the patient's ability to give informed consent")
- OR("psychiatric disorder", "mental disorder", "other medical disorder")